Clinical trial inclusion criterion:
Age 18 years

Entity relations:
- Has_value("Age", "18 years")